¿Qué sistema de transporte utilizan las células foliculares del tiroides para captar yoduro a través de su polo basal?:
1. Un transportador activo primario.
2. Un intercambiador de yoduro con cloruro.
3. Un transportador llamado pendrina.
4. Un proceso de pinocitosis.
5. Un sinportador de yoduro con sodio.

Respuesta correcta: 5. Un sinportador de yoduro con sodio.